Refusal to give consent to participate in the trial

The above is a clinical trial exclusion criterion. Annotated with entity spans:
[Informed_consent: Refusal to give consent to participate in the trial]